Los vegetarianos estrictos con escasa exposición al sol deben consumir alimentos ricos en vitamina:
1. Retinol (A).
2. Ácido ascórbico (C).
3. Calciferol (D).
4. Riboflavina (B2).
5. Niacina (B3).

Respuesta correcta: 3. Calciferol (D).